Clinical trial exclusion criterion:
Language barrier.

Annotated entities:
- Post-eligibility: "Language barrier"